Severe cardiovascular, hepatic, renal disease or neurological impairment.

The above is a clinical trial exclusion criterion. Annotated with entity spans:
Severe cardiovascular, [Condition: hepatic], [Condition: renal disease] or [Condition: neurological impairment].